Clinical trial exclusion criterion:
Patients with disorders of calcium metabolism and/or hypercalcemia

Entity relations:
- OR("disorders of calcium metabolism", "hypercalcemia")